Clinical trial inclusion criteria:
Male or female who is among 20 to 80 years of age at screening.
Scheduled to electively undergo open-laparotomy.
American Society of Anesthesiology Physical Class 1-3.
Ability and willingness to provide informed consent

Annotated entities:
- Person: "Male"
- Person: "female"
- Value: "20 to 80 years"
- Person: "age"
- Temporal: "at screening"
- Mood: "Scheduled"
- Procedure: "open-laparotomy"
- Mood: "electively"
- Measurement: "American Society of Anesthesiology Physical Class"
- Value: "1-3"
- Informed_consent: "Ability and willingness to provide informed consent"